Clinical trial exclusion criterion:
Has previously received Dapsone therapy.

Annotated entities:
- Drug: "Dapsone"